一位工人由於大腿深部靜脈栓塞正在服用 warfarin，前凝血酵素時間（prothrombin time）INR （international normalization ratio）穩定控制在 2 左右。最近在工廠身體檢查時又發現得了肺結核，已開始服用 rifampin。為了良好控制靜脈栓塞及避免併發出血，目前最適當的處理方式為何？
A. 減低 warfarin 的劑量
B. 保持 warfarin 原來的劑量
C. 增加 warfarin 的劑量
D. 停止 warfarin，改用 aspirin

正確答案：C. 增加 warfarin 的劑量